Non-resident of Scotland

The above is a clinical trial exclusion criterion. Annotated with entity spans:
[Person: Non-resident] of [Visit: Scotland]